Clinical trial inclusion criterion:
Forced expiratory volume/Forced vital capacity (FEV1 / FVC) > 70% of predicted;

Annotated entities:
- Measurement: "Forced expiratory volume/Forced vital capacity (FEV1 / FVC)"
- Value: "> 70% of predicted"